Clinical trial inclusion criterion:
Capable of giving informed consent.

Entity relations:
- Has_mood("informed consent", "Capable of giving")